Clinical trial exclusion criterion:
Newly started hormone therapy within the last 6 months

Entity relations:
- Has_temporal("hormone therapy", "within the last 6 months")
- Has_multiplier("hormone therapy", "Newly started")